Clinical trial exclusion criterion:
Impaired renal function (Serum creatinine >1.5 mg/dL in male, >1.4 mg/dL in female )

Entity relations:
- Has_value("male", ">1.5 mg/dL")
- Has_value("female", ">1.4 mg/dL")
- AND("Serum creatinine", "male")
- AND("Impaired renal function", "Serum creatinine")
- OR("male", "female")